Clinical trial exclusion criterion:
Variceal bleeding in the last 90 days

Annotated entities:
- Condition: "Variceal bleeding"
- Temporal: "in the last 90 days"